有一個十個月大的男嬰，持續有嘔吐及間歇性的哭鬧；醫師檢查後發現有腹脹並在右下腹有一可觸摸到的腫塊。最可能的診斷是：
A. 闌尾炎破裂形成腫塊
B. 腸扭轉不全（malrotation）
C. 腸	疊（intussusception）
D. 糞便阻塞（stool impaction）

正確答案：C. 腸	疊（intussusception）